Children who are uncooperative and difficult to manage, have major systemic diseases, or are on long-term medication will be excluded.

The above is a clinical trial exclusion criterion. Annotated with entity spans:
Children who are [Condition: uncooperative] and [Observation: difficult to manage], have [Subjective_judgement: major] [Condition: systemic diseases], or are on [Temporal: long-term] [Drug: medication] will be excluded.